Body mass index less than 18 kg/m2 or greater than 30 kg/m2.

The above is a clinical trial exclusion criterion. Annotated with entity spans:
[Measurement: Body mass index] [Value: less than 18 kg/m2] or [Value: greater than 30 kg/m2].